Clinical trial exclusion criterion:
For subjects enrolled at Russian sites: Acute disease of any severity on the day of vaccination or febrile illness (axillary temperature ≥ 37.0°C).

Annotated entities:
- Visit: "Russian sites"
- Condition: "Acute disease"
- Temporal: "on the day of vaccination"
- Reference_point: "the day of vaccination"
- Condition: "febrile illness"
- Measurement: "axillary temperature"
- Value: "≥ 37.0°C"